Clinical trial exclusion criterion:
Treatment with Urinary alkalinizers (e.g., sodium lactate, potassium citrate)

Entity relations:
- Subsumes("Urinary alkalinizers", "sodium lactate")
- AND("Treatment", "Urinary alkalinizers")
- OR("sodium lactate", "potassium citrate")